Clinical trial exclusion criterion:
Be judged not suitable to participate the study by the investigators

Annotated entities:
- Post-eligibility: "Be judged not suitable to participate the study by the investigators"